下列有關燒傷的緊急處理之敘述，何者正確？
A. 所有燒傷皆可以自來水降溫
B. 所有化學灼傷皆可以自來水減輕傷害
C. 所有小面積燙傷皆可以自來水降溫
D. 所有小面積燒傷皆可以冰敷降溫

正確答案：C. 所有小面積燙傷皆可以自來水降溫